Clinical trial inclusion criterion:
No contraindication to use of progesterone or combined oral contraceptive pills

Annotated entities:
- Negation: "No"
- Condition: "contraindication"
- Drug: "progesterone"
- Drug: "combined oral contraceptive pills"